Clinical trial exclusion criterion:
Previous or concurrent hormonal management of prostate cancer

Annotated entities:
- Procedure: "hormonal management"
- Condition: "prostate cancer"